Una mujer de 24 años de edad consulta al haber apreciado adenopatías inguinales. En el interrogatorio no se recoge la presencia de ninguna molestia local ni datos sugerentes de infección de transmisión sexual. En la exploración se aprecian dos adenopatías, una en cada ingle, de 1 cm de diámetro mayor, blandas, móviles, no dolorosas. No se aprecia ninguna lesión cutánea en miembros inferiores, ano o periné. ¿Qué prueba considera imprescindible?
1. Una serología de lúes puesto que lo más probable es que se trate de una infección por Treponema pallidum.
2. Una exploración ginecológica a fin de descartar un cáncer de ovario.
3. Por las características clínicas parece tratarse de unos ganglios normales y no deben hacerse exploraciones complementarias.
4. Debe realizarse una prueba de Paul-Bunell a fin de descartar una mononucleosis infecciosa.

Respuesta correcta: 3. Por las características clínicas parece tratarse de unos ganglios normales y no deben hacerse exploraciones complementarias.